Which is the primary interacting protein of BLK?

The genes BANK1 and BLK were recently described as associated with SLE a genetic interaction between BANK1 and BLK, and demonstrates that these molecules interact physically.